Fluent in English;

The above is a clinical trial inclusion criterion. Annotated with entity spans:
[Non-query-able: Fluent in English;]